甲醫院手術治療某種疾病，抽樣100個病人有80個治療成功，成功率的95%信賴區間（95% Confidence Interval）為（0.72, 0.88）。如果一般全國平均治療這種病人成功率為 90%，我們想以此資料來做假說檢定，檢定甲醫院治療此病成功率是否比 90%低，顯著水準設為α＝0.05，下列何者正確？
A. 無法推翻虛無假說，結論是甲醫院的治療成功率與 90%一樣
B. 推翻虛無假說，結論是甲醫院的治療成功率比 90%低
C. 無法推翻虛無假說，結論是甲醫院的治療成功率比 90%低
D. 推翻虛無假說，結論是甲醫院的治療成功率與 90%一樣

正確答案：B. 推翻虛無假說，結論是甲醫院的治療成功率比 90%低